Clinical trial exclusion criterion:
Participation in clinical trials or undergoing other investigational procedures within 30 days prior to Day 1

Annotated entities:
- Observation: "Participation in clinical trials"
- Observation: "undergoing other investigational procedures"
- Temporal: "within 30 days prior to Day 1"
- Reference_point: "prior to Day 1"